Durante el entrenamiento en solución de problemas propio de la Terapia de Solución de Problemas, el principio de “aplazamiento del juicio” está indicado en la fase de:
1. Orientación hacia el problema.
2. Toma de decisiones.
3. Puesta en práctica de la alternativa elegida.
4. Generación de alternativas de solución.

Respuesta correcta: 4. Generación de alternativas de solución.